Allergy to hyaluronic acid

The above is a clinical trial exclusion criterion. Annotated with entity spans:
[Condition: Allergy] to [Drug: hyaluronic acid]